Si intentamos disolver amoníaco en agua observamos que:
1. Es completamente soluble.
2. Es poco soluble.
3. Debería ser poco soluble, pero la solubilidad aumenta notablemente por reacción ácidobase entre ellos, dando lugar a una disolución ácida.
4. Debería ser poco soluble, pero la solubilidad aumenta notablemente por reacción redox entre ellos, liberándose hidrógeno.
5. Es muy soluble, favorecido por la formación de enlaces de hidrógeno entre los dos compuestos.

Respuesta correcta: 5. Es muy soluble, favorecido por la formación de enlaces de hidrógeno entre los dos compuestos.